The diagnosis of developmental delay, attention deficit disorder, chronic pain, psychiatric illness, previous open abdominal surgery, the presence of a gastrostomy, ventricular-peritoneal shunt or other abdominal prosthesis, immunosuppression, and those allergic to any of the medications.

The above is a clinical trial exclusion criterion. Annotated with entity spans:
The diagnosis of [Condition: developmental delay], [Condition: attention deficit disorder], [Condition: chronic pain], [Condition: psychiatric illness], [Temporal: previous] [Procedure: open abdominal surgery], the presence of a [Device: gastrostomy], [Device: ventricular-peritoneal shunt] or other [Device: abdominal prosthesis], [Condition: immunosuppression], and those [Condition: allergic] to [Drug: any of the medications].